Pacing threshold(s) (at 0.4 or 0.5 ms) and/or sensing amplitude(s) and/or impedance(s) are not measurable

The above is a clinical trial exclusion criterion. Annotated with entity spans:
[Procedure: Pacing threshold](s) ([Qualifier: at 0.4 or 0.5 ms]) and/or [Procedure: sensing amplitude](s) and/or [Procedure: impedance](s) are [Condition: not measurable]